下列何種疾病最常伴有潛在性癌症（occult cancer）？
A. 類風濕關節炎（rheumatoid arthritis）
B. 肌肉失養症（muscular dystrophy）
C. 運動元神經疾病（motor neuron diseases）
D. 皮肌炎（dermatomyositis）

正確答案：D. 皮肌炎（dermatomyositis）